對 penicillin 類抗生素產生抗藥性，最常見的機轉是：
A. 細菌結合 penicillin 的蛋白質（PBPs）發生改變，使 penicillin 無法作用
B. 細菌產生β-lactamase，可將 penicillin 分解
C. 藥物無法穿透細菌的外層膜孔道（porin），而進入細菌作用
D. 細菌產生流出幫浦（efflux pump），可將藥物打出細胞外

正確答案：B. 細菌產生β-lactamase，可將 penicillin 分解